Severe uncorrected insulin insufficiency

The above is a clinical trial exclusion criterion. Annotated with entity spans:
[Qualifier: Severe] [Qualifier: uncorrected] [Condition: insulin insufficiency]